Clinical trial exclusion criterion:
Illiterate

Annotated entities:
- Observation: "Illiterate"